Clinical trial inclusion criterion:
Phase 1 Specific Patient at least 18yrs of age with histologically confirmed CLL/SLL or B-cell Non-Hodgkin lymphoma (DLBCL, FL, MCL, MZL, lymphoplasmacytic lymphoma).

Entity relations:
- Subsumes("CLL", "DLBCL")
- Has_value("age", "at least 18yrs")
- Has_value("histologically", "confirmed")
- AND("CLL", "histologically")
- AND("DLBCL", "FL")
- AND("FL", "MCL")
- AND("MCL", "MZL")
- AND("MZL", "lymphoplasmacytic lymphoma")
- OR("CLL", "B-cell Non-Hodgkin lymphoma", "SLL")